Un hombre de 65 años, fumador y diabético, es traído al Servicio de Urgencias por presentar desde hace aproximadamente una hora un dolor centrotorácico opresivo e intensa sudoración. En el ECG realizado se observa ritmo sinusal a 80 lpm y un bloqueo completo de rama izquierda. ¿Cuál debería ser nuestra actitud?
1. Realizar una determinación analítica de troponina y esperar su resultado para confirmar la presencia de un infarto agudo de miocardio.
2. Tratar al paciente como si fuera un infarto con elevación del segmento ST, planteando una terapia de reperfusión lo más precoz posible.
3. Implantar un marcapasos transcutáneo ante la posibilidad de que desarrolle un bloqueo más avanzado.
4. Realizar una TC urgente para descartar la presencia de una embolia pulmonar aguda.
5. Como pudiera tratarse de una pericarditis aguda administraremos AINEs.

Respuesta correcta: 2. Tratar al paciente como si fuera un infarto con elevación del segmento ST, planteando una terapia de reperfusión lo más precoz posible.